Type 1 or 2 diabetes

The above is a clinical trial inclusion criterion. Annotated with entity spans:
[Condition: Type 1] or 2 diabetes